醫師因診療病人，需使用廠商研製之醫藥產品；而廠商對於醫學研究、會議、教育之支持，有助於醫學之進步。但醫師於照護病人及廠商行銷產品之間，可能面對利益衝突。行政院衛生署訂有「醫師與廠商間關係」守則，下列何者錯誤？
A. 公開
B. 避免利益衝突
C. 依據病人最佳利益執行臨床判斷之自主性
D. 完全禁止

正確答案：D. 完全禁止